What induces Arabidopsis ROF1 expression?

The abundance of ROF1 increased several-fold under stress conditions such as  wounding, heat stress or exposure to elevated NaCl levels.